With bad compliance or contraindication to enrollment.

The above is a clinical trial exclusion criterion. Annotated with entity spans:
With [Condition: bad compliance] or [Condition: contraindication to enrollment].